Indique cuál de los siguientes trastornos es una enfermedad lisosomal:
1. Déficit de GLUT2.
2. Déficit de HSL (lipasa sensible a las hormonas).
3. Déficit de LPL (lipoproteína lipasa).
4. Déficit de transportadores de aminoácidos básicos.
5. Esfingolipidosis.

Respuesta correcta: 5. Esfingolipidosis.